一位 5 歲男孩，來到急診處，主訴從昨晚開始右側陰囊疼痛，沒有發燒，活力正常，下列何者錯誤？
A. 鑑別診斷包括急性睪丸扭轉（testicular torsion）、急性副睪丸炎、外傷等
B. 都卜勒（Doppler）超音波檢查如果顯示睪丸內血流增加，且尿液中白血球顯著增加，較可能是急性副睪丸炎
C. 如果男孩站立時，理學檢查托起陰囊會減輕疼痛，比較像是急性副睪丸炎
D. 有時不易分辨睪丸扭轉或急性副睪丸炎時，必須開刀探查

正確答案：C. 如果男孩站立時，理學檢查托起陰囊會減輕疼痛，比較像是急性副睪丸炎